Clinical trial inclusion criterion:
Creatinine clearance >30 milliliters/minute/1.73 centimeter squared

Entity relations:
- Has_value("Creatinine clearance", ">30 milliliters/minute/1.73 centimeter squared")